Medical conditions that require consistent use of medication or compromise sleep;

The above is a clinical trial exclusion criterion. Annotated with entity spans:
[Non-query-able: Medical conditions that require consistent use of medication or compromise sleep];